¿Cuáles son las atribuciones al fracaso que más posibilidades tienen de producir indefensión?
1. Las atribuciones internas, inestables y generales.
2. Las atribuciones internas, estables y específicas.
3. Las atribuciones externas, estables y generales.
4. Las atribuciones internas, estables y generales.
5. Las atribuciones externas, estables y específicas.

Respuesta correcta: 4. Las atribuciones internas, estables y generales.